La acción cancerígena del Benzo(a)pireno:
1. Se debe a la producción de radicales libres de oxígeno.
2. Se debe a su biotransformación en un dihidrodiol.
3. Se debe a su biotransformación en un epóxido.
4. Aumenta en tejidos ricos en epóxidohidrolasa.
5. Disminuye en tejidos ricos en citocromo P450.

Respuesta correcta: 3. Se debe a su biotransformación en un epóxido.